Clinical trial inclusion criterion:
Patients with osteoarthritis of the hip secondary to degeneration, inflammatory arthritis, gouty arthritis, acetabular dysplasia or osteonecrosis of the femoral head, and undergoing primary unilateral minimally invasive THA

Entity relations:
- multi("secondary to degeneration", "degeneration")
- Has_qualifier("osteoarthritis", "hip")
- Has_qualifier("osteoarthritis", "secondary to degeneration")
- Has_qualifier("minimally invasive THA", "unilateral")
- Has_qualifier("minimally invasive THA", "primary")
- Has_temporal("minimally invasive THA", "undergoing")
- Has_qualifier("acetabular dysplasia", "femoral head")
- OR("acetabular dysplasia", "osteonecrosis")
- OR("osteoarthritis", "minimally invasive THA", "gouty arthritis", "inflammatory arthritis", "acetabular dysplasia")